Clinical trial inclusion criterion:
Subjects referred to diagnostic or therapeutic colonoscopy.

Annotated entities:
- Observation: "diagnostic"
- Observation: "therapeutic"
- Procedure: "colonoscopy"